acute cardiovascular or cerebrovascular accidents within past 3 months;

The above is a clinical trial exclusion criterion. Annotated with entity spans:
[Qualifier: acute] cardiovascular or [Condition: cerebrovascular accidents] [Temporal: within past 3 months];